Clinical trial exclusion criterion:
Contraindication for hepatectomy, including gastrointestinal hemorrhage, severe hemorrhagic disorders, explicit acute nonspecific infectious lesion, overt ascites, Child-Pugh Score C, indocyanine green retention rate at 15min (ICGR15)＞30%(12), serum hepatitis B virus (HBV)-DNA＞126 copies/ml and serum alanine aminotransferase (ALT) ＞ 2×ULN, serum triglycerides＞2.0 mmol/L, circulatory shock, stroke, acute myocardial infarction, renal failure, coma of unknown cause

Entity relations:
- Has_qualifier("hemorrhagic disorders", "severe")
- Has_qualifier("infectious lesion", "nonspecific")
- Has_temporal("infectious lesion", "acute")
- Has_qualifier("ascites", "overt")
- Has_value("Child-Pugh Score", "C")
- Has_value("indocyanine green retention rate at 15min (ICGR15)", "＞30%")
- Has_value("serum alanine aminotransferase (ALT)", "＞ 2×ULN")
- Has_value("serum triglycerides", "＞2.0 mmol/L")
- Has_qualifier("coma", "unknown cause")
- Has_value("serum hepatitis B virus (HBV)-DNA", "＞126 copies/ml")
- Subsumes("Contraindication for hepatectomy", "gastrointestinal hemorrhage")
- AND("Contraindication for hepatectomy", "hepatectomy")
- OR("gastrointestinal hemorrhage", "hemorrhagic disorders", "infectious lesion", "ascites", "Child-Pugh Score", "indocyanine green retention rate at 15min (ICGR15)", "serum hepatitis B virus (HBV)-DNA", "serum alanine aminotransferase (ALT)", "serum triglycerides", "circulatory shock", "stroke", "acute myocardial infarction", "renal failure", "coma")